5. Capacity to provide consent to participate in research (assessment made by study physician)

The above is a clinical trial inclusion criterion. Annotated with entity spans:
5. [Non-query-able: Capacity to provide consent to participate in research (assessment made by study physician)]